Platelets > 50,000

The above is a clinical trial inclusion criterion. Annotated with entity spans:
[Measurement: Platelets] [Value: > 50,000]